下列何者不支配前腹壁構造？
A. 髂腹下神經（iliohypogastric nerve）
B. 髂腹股溝神經（ilioinguinal nerve）
C. 生殖股神經（genitofemoral nerve）
D. 閉孔神經（obturator nerve）

正確答案：D. 閉孔神經（obturator nerve）